Which disease can be treated with Relugolix.

Relugolix has a role in treatment of prostate cancer, uterine fibroids, endometriosis and uterine myomas.